Subject has rapid joint disease, bone absorption, osteopenia, osteomalacia, and/or osteoporosis. Osteoporosis or osteopenia are relative contraindications, since this condition may limit the degree of obtainable correction and/or the amount of mechanical fixation.

The above is a clinical trial inclusion criterion. Annotated with entity spans:
Subject has [Condition: rapid joint disease], [Condition: bone absorption], [Condition: osteopenia], [Condition: osteomalacia], and/or [Condition: osteoporosis]. [Condition: Osteoporosis] or [Condition: osteopenia] are [Qualifier: relative] [Condition: contraindications], since this condition may limit the degree of obtainable correction and/or the amount of mechanical fixation.